Recently commenced psychotherapy (within four weeks of study entry)

The above is a clinical trial inclusion criterion. Annotated with entity spans:
[Temporal: Recently] commenced [Procedure: psychotherapy] ([Temporal: within four weeks of study entry])